Clinical trial inclusion criterion:
No relapse of a previously unrecognized ALL

Annotated entities:
- Condition: "ALL"
- Qualifier: "previously unrecognized"
- Negation: "No"
- Condition: "relapse"